Clinical trial inclusion criterion:
No prior radiation therapy for at least 4 weeks before enrollment in the study

Annotated entities:
- Procedure: "radiation therapy"
- Temporal: "at least 4 weeks before enrollment"
- Negation: "No"
- Temporal: "prior"
- Reference_point: "enrollment"